Clinical trial inclusion criterion:
Planned revascularization of any vessel within 30 days post-index procedure and/or of the target vessel(s) within 12 months post-procedure

Annotated entities:
- Procedure: "revascularization"
- Mood: "Planned"
- Qualifier: "any vessel"
- Temporal: "within 30 days post-index procedure"
- Reference_point: "index procedure"
- Temporal: "within 12 months post-procedure"
- Reference_point: "procedure"
- Qualifier: "of the target vessel(s)"